History of significant drug hypersensitivity or anaphylaxis.

The above is a clinical trial exclusion criterion. Annotated with entity spans:
[Temporal: History] of [Qualifier: significant] [Condition: drug hypersensitivity] or anaphylaxis.